Clinical trial exclusion criterion:
Concomitant or previous malignancies with the exception of adequately treated basal cell or squamous cell skin cancer, in situ cervical cancer, incidental carcinoid, or other cancer from which the patient has been disease free for 5 years.

Entity relations:
- Has_qualifier("malignancies", "Concomitant")
- Has_qualifier("basal cell skin cancer", "adequately treated")
- Has_negation("basal cell skin cancer", "the exception of")
- Has_temporal("has been disease free", "for 5 years")
- Has_qualifier("basal cell skin cancer", "has been disease free")
- OR("Concomitant", "previous")
- OR("basal cell skin cancer", "in situ cervical cancer", "incidental carcinoid", "other cancer", "squamous cell skin cancer")